What kind of chromatography is HILIC?

Hydrophilic Interaction Chromatography (HILIC)